In which cellular compartment do stress granules localize?

Stress granules (SGs) are cytoplasmic inclusions that repress translation of a subset of RNAs in times of cellular stress, and are characteristic to eukaryotic cells.